Clinical trial inclusion criterion:
Patients undergoing percutaneous coronary intervention and need to take dual antiplatelet therapy continuously at least 12weeks

Entity relations:
- Has_qualifier("dual antiplatelet therapy", "continuously")
- Has_temporal("dual antiplatelet therapy", "at least 12weeks")
- OR("percutaneous coronary intervention", "dual antiplatelet therapy")